Clinical trial exclusion criteria:
Clear indication for specific duration of dual anti-platelet therapy
Type 2 myocardial infarction
Contraindication to aspirin or P2Y12 receptor antagonist
Non-resident of Scotland
Previous recruitment into the trial
Inability or unwilling to give informed consent

Annotated entities:
- Procedure: "dual anti-platelet therapy"
- Condition: "Clear indication for specific duration"
- Condition: "Type 2 myocardial infarction"
- Condition: "Contraindication"
- Condition: "aspirin"
- Condition: "P2Y12 receptor antagonist"
- Person: "Non-resident"
- Visit: "Scotland"
- Competing_trial: "Previous recruitment into the trial"
- Informed_consent: "Inability or unwilling to give informed consent"